有關抗乙醯膽鹼藥物（anticholinergic drugs），何者錯誤？
A. 阿托平（atropine）為三級胺（tertiary amine），可通過腦血屏障礙（blood-brain barrier）
B. glycopyrrolate 為四級銨（quaternary ammonium），不會通過腦血屏障礙
C. glycopyrrolate 的止涎效果（antisialagogue effect）比阿托平強
D. 阿托平不會產生中樞系統興奮作用

正確答案：D. 阿托平不會產生中樞系統興奮作用